Le presentan un estudio de cohortes en el que han participado 1000 mujeres fumadoras y 2000 mujeres de la misma edad no fumadoras. Si al cabo de 5 años, han presentado un ictus 30 mujeres fumadoras y 20 mujeres no fumadoras, ¿cuál sería el riesgo relativo y el riesgo atribuible?
1. Riesgo relativo = 3, riesgo atribuible = 10 de cada 1000.
2. Riesgo relativo = 3, riesgo atribuible = 20 de cada 1000.
3. Riesgo relativo = 1.5, riesgo atribuible = 10 de cada 1000.
4. Riesgo relativo = 1.5, riesgo atribuible = 30 de cada 1000.
5. Riesgo relativo = 10 de cada 1000, riesgo atribuible = 3.

Respuesta correcta: 2. Riesgo relativo = 3, riesgo atribuible = 20 de cada 1000.